¿A qué variable de personalidad alude la definición “tendencia a experimentar emociones negativas junto con una elevada inhibición social”?
1. Depresión.
2. Personalidad Tipo D.
3. Indefensión.
4. Patrón de conducta Tipo A.
5. Hostilidad.

Respuesta correcta: 2. Personalidad Tipo D.